Clinical trial exclusion criterion:
Inadequate RBC mass based on TBV <4500 ml (above) or screening Hb <14 g/dL

Entity relations:
- Has_qualifier("RBC mass", "Inadequate")
- Has_value("TBV", "<4500 ml")
- Has_value("Hb", "<14 g/dL")
- AND("RBC mass", "TBV")
- OR("TBV", "Hb")